Clinical trial inclusion criterion:
Adult women at least 18 years of age

Annotated entities:
- Person: "Adult"
- Person: "women"
- Value: "at least 18 years"
- Person: "age"